Current tobacco use

The above is a clinical trial exclusion criterion. Annotated with entity spans:
[Temporal: Current] [Observation: tobacco use]